Clinical trial exclusion criterion:
Where participation in the study would result in donation of blood or blood products in excess of 500 mL within a 90 day period.

Annotated entities:
- Non-query-able: "Where participation in the study would result in donation of blood or blood products in excess of 500 mL within a 90 day period."
- Undefined_semantics: "Where participation in the study would result in donation of blood or blood products in excess of 500 mL within a 90 day period."
- Context_Error: "Where participation in the study would result in donation of blood or blood products in excess of 500 mL within a 90 day period."